一位三星期大女嬰因全身水腫，尿量減少而就診。實驗檢查發現蛋白尿 4+，24 小時蛋白尿為 10.5 g，血中白蛋白為 0.88 mg/dL，膽固醇：498 mg/dL，三酸甘油脂：248 mg/dL，下列之描述何者錯誤？
A. 預後良好，用類固醇治療後，蛋白尿與水腫可迅速獲得緩解
B. 診斷為 congenital nephrotic syndrome
C. 先天的感染如 syphilis 或 HIV 可以造成此種情況
D. 這類病人可因嚴重感染導致菌血症而死亡

正確答案：A. 預後良好，用類固醇治療後，蛋白尿與水腫可迅速獲得緩解